Clinical trial inclusion criterion:
Willing to undergo to serological testing to HIV, HBV and HCV;

Annotated entities:
- Procedure: "serological testing to HIV"
- Procedure: "serological testing to HBV"
- Procedure: "serological testing to HCV"
- Non-query-able: "Willing to undergo to serological testing to HIV, HBV and HCV;"
- Post-eligibility: "Willing to undergo to serological testing to HIV, HBV and HCV;"